Clinical trial inclusion criterion:
Age =18 and = 65 years

Entity relations:
- Has_value("Age", "=18 and = 65 years")